Unsuitable patients judged by investigator

The above is a clinical trial exclusion criterion. Annotated with entity spans:
[Non-query-able: Unsuitable patients judged by investigator]